List characteristics of Developmental and Epileptic Encephalopathies (DEEs).

Developmental and epileptic encephalopathies (DEEs) are a heterogeneous group of disorders characterized by global developmental delay, contractures, refractory seizures, intractable seizures, epilepsy, facial dysmorphism, macrocephaly, cognitive deficits, autism, seizures, cerebellar dysgenesis, developmental delayed, behavioral abilities, developmental impairment or regression.